下列有關主要組織相容複合體分子（MHC molecules）之描述，那一項錯誤？
A. 高度多型性（highly polymorphic）之區域為胜肽（peptide）結合位置
B. 高度多型性（highly polymorphic）之區域為 T 細胞受器（T cell receptor）辨識位置
C. HLA-A、HLA-B、HLA-C 相互間之關係，稱之為多型性（polymorphism）
D. 能夠與共同接受器（co-receptor）結合

正確答案：C. HLA-A、HLA-B、HLA-C 相互間之關係，稱之為多型性（polymorphism）